Chronic pain syndrome

The above is a clinical trial inclusion criterion. Annotated with entity spans:
[Condition: Chronic pain syndrome]